Clinical trial inclusion criterion:
Women of child-bearing potential (WCBP) must have a negative serum pregnancy test 72 hours or less prior to starting treatment

Annotated entities:
- Condition: "child-bearing potential"
- Person: "Women"
- Person: "WCBP"
- Measurement: "serum pregnancy test"
- Value: "negative"
- Temporal: "72 hours or less prior to starting treatment"
- Reference_point: "starting treatment"
- Procedure: "treatment"
- Pregnancy_considerations: "Women of child-bearing potential (WCBP) must have a negative serum pregnancy test 72 hours or less prior to starting treatment"